Clinical trial exclusion criterion:
antiseizure medications including valproic acid, zonisamide, topiramate, and lamotrigine

Annotated entities:
- Drug: "antiseizure medications"
- Drug: "valproic acid"
- Drug: "zonisamide"
- Drug: "topiramate"
- Drug: "lamotrigine"